Eflornithine 通常用以治療何種疾病？
A. 弓蟲症（toxoplasmosis）
B. 甘比亞睡眠病（Gambian sleeping sickness）
C. 片山熱（Katayama fever）
D. 旋毛蟲症（trichinosis）

正確答案：B. 甘比亞睡眠病（Gambian sleeping sickness）